Clinical trial exclusion criterion:
Previous organ transplantation

Entity relations:
- Has_temporal("organ transplantation", "Previous")